Clinical trial exclusion criterion:
Cardiovascular or pulmonary disease

Entity relations:
- OR("Cardiovascular disease", "pulmonary disease")